Clinical trial exclusion criterion:
History of severe related adverse event(s) from previous participation in VA-001 or VA-006 trials or to any smallpox vaccination.

Annotated entities:
- Condition: "adverse event"
- Procedure: "smallpox vaccination"
- Undefined_semantics: "previous participation in VA-001 or VA-006 trials"